關於胰臟癌的敘述，下列何者正確？
A. 抽菸是胰臟癌的重要危險因子，約有20～25%的胰臟癌與抽菸有關
B. 大約有80%以上的胰臟癌有遺傳傾向，如germline mutations：STK11 gene、BRCA2、p16/CDKN2A、 PALB2等
C. 篩檢胰臟癌，血清學檢驗CA19-9及CEA都有相當不錯的敏感度及陽性預測值
D. 晚期遠處轉移之胰臟癌的第一線治療為gemcitabine，使用此藥物治療，病患一年的存活率可達70%

正確答案：A. 抽菸是胰臟癌的重要危險因子，約有20～25%的胰臟癌與抽菸有關